Clinical trial exclusion criterion:
15. Female subject is pregnant or plan to become pregnant

Entity relations:
- Has_mood("pregnant", "plan")
- OR("pregnant", "pregnant")